Tras la recepción de la luz, la permeabilidad de los fotorreceptores al:
1. Sodio disminuye.
2. Potasio disminuye.
3. AMPc aumenta.
4. GMPc aumenta.

Respuesta correcta: 1. Sodio disminuye.